Hemodynamic instability;

The above is a clinical trial exclusion criterion. Annotated with entity spans:
[Condition: Hemodynamic instability];